Clinical trial exclusion criterion:
uterine size >12 weeks.

Entity relations:
- Has_value("uterine size", ">12 weeks")